Clinical trial exclusion criterion:
Patients with a prior serious hypersensitivity reaction to liraglutide

Entity relations:
- AND("hypersensitivity reaction", "liraglutide")
- Has_qualifier("hypersensitivity reaction", "serious")
- Has_temporal("hypersensitivity reaction", "prior")